下列那一項儀器，是檢查圓錐角膜（keratoconus）早期病變最敏感且有效的儀器？
A. 鏡射光顯微鏡（specular microscope）
B. 角膜弧度地形檢查儀（computerized videokeratoscope）
C. 眼底鏡（ophthalmoscope）
D. 眼壓計（tonometer）

正確答案：B. 角膜弧度地形檢查儀（computerized videokeratoscope）